下列有關類骨質（osteoid）的敘述何者正確？
A. 是完全鈣化的骨基質
B. 是骨基質鈣化前的有機質
C. 是破骨細胞的分泌物
D. 是形成軟骨的前驅物質

正確答案：B. 是骨基質鈣化前的有機質